Un hombre de 58 años refería una historia de 3 semanas de evolución con lesiones cutáneas progresivas, medianamente dolorosas, en su brazo izquierdo. Había empezado como una lesión eritematosa en su pulgar izquierdo. Tenía unas estrías rojizas visibles como líneas de conexión entre las lesiones. El paciente no presentaba fiebre ni otros síntomas generales. Había estado trabajando en su jardín pero no recordaba haberse hecho ninguna herida. El diagnóstico etiológico se realizó por cultivo de una biopsia cutánea. ¿Cuál es el agente causal más probable de este proceso?
1. Dermatofitosis por Microsporum gypseum.
2. Infección cutánea por Staphylococcus aureus.
3. Esporotricosis.
4. Infección cutánea por Mycobacterum marinum.

Respuesta correcta: 3. Esporotricosis.